Clinical trial exclusion criterion:
Preoperative neurological deficits

Entity relations:
- Has_qualifier("neurological deficits", "Preoperative")